Clinical trial exclusion criterion:
Chronic or recurrent uveitis.

Entity relations:
- Has_multiplier("uveitis", "Chronic")
- OR("Chronic", "recurrent")